Patient in sepsis and colistin was administered empirically to increase antibiotic coverage.

The above is a clinical trial inclusion criterion. Annotated with entity spans:
Patient in [Condition: sepsis] and [Drug: colistin] was [Procedure: administered empirically] to increase antibiotic coverage.